Clinical trial exclusion criterion:
Acute Deep Vein Thrombosis

Annotated entities:
- Condition: "Acute Deep Vein Thrombosis"